Clinical trial inclusion criteria:
=18 years old, men or post-menopausal women (women with no periods for 12 months or more, or those who have had a surgical menopause)
Treated hypertensive patients with an average daytime ambulatory blood pressure measurement (ABPM) <150/95mmHg on stable doses of one or more antihypertensive medication (at least one of which should be; an ACE inhibitor, angiotensin receptor blocker or diuretic) for 3 months, or untreated hypertensive patients with an average daytime ABPM =135/85 but <150/95.

Annotated entities:
- Value: "=18"
- Person: "years old"
- Person: "men"
- Condition: "post-menopausal"
- Person: "women"
- Condition: "no periods"
- Temporal: "for 12 months or more"
- Procedure: "surgical"
- Condition: "menopause"
- Condition: "hypertensive"
- Qualifier: "Treated"
- Measurement: "average daytime ambulatory blood pressure measurement (ABPM)"
- Value: "<150/95mmHg"
- Qualifier: "stable doses"
- Drug: "antihypertensive medication"
- Multiplier: "one or more"
- Drug: "ACE inhibitor"
- Drug: "angiotensin receptor blocker"
- Drug: "diuretic"
- Multiplier: "at least one"
- Temporal: "for 3 months"
- Qualifier: "untreated"
- Condition: "hypertensive patients"
- Measurement: "average daytime ABPM"
- Value: "=135/85 but <150/95"